Clinical trial exclusion criterion:
Chronic pain or narcotic usage during the preceding 30 days

Annotated entities:
- Condition: "Chronic pain"
- Drug: "narcotic"
- Temporal: "during the preceding 30 days"